有關肺泡（alveolus）的描述，下列何者錯誤？
A. 為呼吸系統中氣體交換之區域
B. 末端細支氣管（terminal bronchioles）具有肺泡
C. 第一型細胞是一種連續扁平的上皮細胞
D. 第二型細胞可分泌表面作用素（surfactant）

正確答案：B. 末端細支氣管（terminal bronchioles）具有肺泡